Clinical trial inclusion criterion:
Age 19 years of age or older (The age of consent in Nebraska)

Entity relations:
- Has_value("Age", "19 years of age or older")